Clinical trial inclusion criterion:
Participants must have English fluency sufficient to complete study measures.

Annotated entities:
- Non-query-able: "articipants must have English fluency sufficient to complete study measures"